Clinical trial inclusion criterion:
Signs of (RV) failure as indicated by NT-proBNP levels >600 pg/ml at baseline.

Annotated entities:
- Condition: "RV) failure"
- Measurement: "NT-proBNP levels"
- Value: ">600 pg/ml"